某嬰兒病房出現 4 名呼吸道細胞融合病毒（respiratory syncytial virus）的院內感染病例，下列那一項是最有效的感染管制措施？
A. 病房每天用紫外線照射一小時
B. 加強洗手
C. 所有住院嬰兒靜脈注射免疫球蛋白
D. 嬰兒的呼吸道分泌物用漂白水消毒

正確答案：B. 加強洗手